outpatients aged 18-70 years

The above is a clinical trial inclusion criterion. Annotated with entity spans:
[Visit: outpatients] [Person: aged] [Value: 18-70 years]